Explain the association between Barr bodies (nuclear inclusions) and the X chromosome?

Barr body is an inactivated X chromosome in the normal female somatic cell